Clinical trial inclusion criterion:
type 1 and 2 diabetic patients

Annotated entities:
- Condition: "diabetic"
- Qualifier: "type 1"
- Qualifier: "type 2"